Lactose intolerance

The above is a clinical trial exclusion criterion. Annotated with entity spans:
[Condition: Lactose intolerance]